¿Qué vector se utilizaría para clonar un fragmento de ADN de hasta 15 Kb?:
1. BAC.
2. Plásmido.
3. Cósmido.
4. YAC.
5. Fago λ.

Respuesta correcta: 2. Plásmido.